Clinical trial exclusion criterion:
pregnant or breastfeeding woman

Annotated entities:
- Pregnancy_considerations: "pregnant or breastfeeding woman"